El número de corpúsculos de Barr de las células de un hombre con cariotipo 48,XXXY es:
1. 2.
2. 1.
3. 0.
4. 3.
5. 4.

Respuesta correcta: 1. 2.